Patients must have a predicted life expectancy of at least 12 weeks.

The above is a clinical trial inclusion criterion. Annotated with entity spans:
Patients must have a [Measurement: predicted life expectancy] of [Value: at least 12 weeks].